stimulant medications (eg, Ritalin, Concerta, Biphetamine, and Dexedrine)

The above is a clinical trial exclusion criterion. Annotated with entity spans:
[Drug: stimulant medications] (eg, [Drug: Ritalin], [Drug: Concerta], [Drug: Biphetamine], and [Drug: Dexedrine])